心臟移植後的病人，在短時間劇烈運動後，下列那一項參數的變化較不明顯？
A. 心跳速率（heart rate）
B. 心輸出量（cardiac output）
C. 心搏出量（stroke volume）
D. 耗氧量（O2 consumption）

正確答案：A. 心跳速率（heart rate）